History of kidney stones

The above is a clinical trial exclusion criterion. Annotated with entity spans:
[Temporal: History of] [Condition: kidney stones]